最常見的腦中風類型是：
A. 缺血性腦梗塞（ischemic infarction）
B. 腦出血（intracerebral hemorrhage）
C. 蜘蛛膜下出血（subarachnoid hemorrhage）
D. 血栓性腦梗塞（embolic infarction）

正確答案：A. 缺血性腦梗塞（ischemic infarction）